Clinical trial exclusion criterion:
IIEF < 21

Annotated entities:
- Measurement: "IIEF"
- Value: "< 21"